Clinical trial exclusion criterion:
Admission from an other ICU where the patient remained for more than 24 hours

Entity relations:
- Has_multiplier("patient remained", "for more than 24 hours")
- AND("Admission", "an other ICU")
- Has_context("an other ICU", "patient remained")